下列何者與橈神經（radial nerve）伴行並通行於橈神經溝？
A. 旋肱後動脈（posterior circumflex humeral artery）
B. 旋肱前動脈（anterior circumflex humeral artery）
C. 肱深動脈（profunda brachii artery）
D. 橈側返動脈（radial recurrent artery）

正確答案：C. 肱深動脈（profunda brachii artery）